Which cellular function is associated with transcription factors forkhead 1 and 2 (Fkh1 and Fkh2)?

Here we show that the yeast Forkhead transcription factors, Fkh1 and Fkh2, are global determinants of replication origin timing. Forkhead box O (FOXO) transcription factors have a conserved function in regulating metazoan lifespan.